Clinical trial exclusion criterion:
known for dexmedetomidine or other drugs allergy in this study.

Annotated entities:
- Drug: "dexmedetomidine"
- Qualifier: "other"
- Drug: "drugs"
- Condition: "allergy"